Clinical trial inclusion criterion:
Have symptoms of both stress and urgency urinary incontinence

Entity relations:
- OR("stress urinary incontinence", "urgency urinary incontinence")